下列何者不屬於嗅皮質？
A. 梨狀皮質（piriform cortex）
B. 杏核核（amygdaloid nucleus）
C. 嗅結節（olfactory tubercle）
D. 中隔區（septal region）

正確答案：D. 中隔區（septal region）